La enfermedad de Lyme es producida por:
1. Borrelia burgdorferi.
2. Treponema saccharophilum.
3. Spirillum commune.
4. Leptospira interrogans.
5. Limulus poliphemus.

Respuesta correcta: 1. Borrelia burgdorferi.